Clinical trial exclusion criterion:
Hypotonia

Annotated entities:
- Condition: "Hypotonia"